Clinical trial inclusion criterion:
Age ≥ 18 years

Annotated entities:
- Person: "Age"
- Value: "≥ 18 years"